Clinical trial inclusion criterion:
American Spinal Injury Association Impairment Scale A or B

Annotated entities:
- Measurement: "American Spinal Injury Association Impairment Scale"
- Value: "A or B"